Clinical trial exclusion criterion:
All subjects with any cardiac disease or history of cardiac arrhythmias will be excluded.

Entity relations:
- Has_temporal("cardiac arrhythmias", "history")
- OR("cardiac disease", "cardiac arrhythmias")